下列何種電學診斷檢查在分辨急性與慢性神經病變最有用處？
A. 神經傳導（nerve conduction）
B. 肌肉電刺激激發（muscle excitability）
C. 針肌電圖（needle electromyography）
D. 連續電刺激神經（repetitive nerve stimulation）

正確答案：C. 針肌電圖（needle electromyography）